Which subcortical brain structure is influenced the most by common genetic variants?

The putamen is the most affected by common genetic variants. It is the subcortical brain structure responsible for learning and memory consolidation.